子宮在分娩準備期（PhaseⅠ），何者正確？
A. 子宮仍相當穩定
B. 子宮肌細胞之催產素受體大量增加
C. 子宮肌細胞間之 Gap junctions 減少
D. 對前列腺素（Prostaglandins）尚無反應

正確答案：B. 子宮肌細胞之催產素受體大量增加